Clinical trial inclusion criterion:
Histological confirmation of relapsed/refractory diffuse large B-cell lymphoma after prior rituximab and anthracycline-containing systemic treatment regimen such as R-CHOP (rituximab, cyclophosphamide, doxorubicin, vincristine, and prednisone), R-EPOCH (rituximab, etoposide phosphate, prednisone, vincristine sulfate, cyclophosphamide, doxorubicin hydrochloride), R-HyperCVAD (rituximab, cyclophosphamide, vincristine sulfate, doxorubicin hydrochloride, dexamethasone) etc.

Annotated entities:
- Procedure: "Histological"
- Value: "confirmation"
- Condition: "B-cell lymphoma"
- Qualifier: "large"
- Qualifier: "diffuse"
- Procedure: "rituximab and anthracycline-containing systemic treatment regimen"
- Drug: "R-CHOP"
- Drug: "rituximab"
- Drug: "cyclophosphamide"
- Drug: "doxorubicin"
- Drug: "vincristine"
- Drug: "prednisone"
- Drug: "R-EPOCH"
- Drug: "rituximab"
- Drug: "etoposide phosphate"
- Drug: "prednisone"
- Drug: "vincristine sulfate"
- Drug: "cyclophosphamide"
- Drug: "doxorubicin hydrochloride"
- Drug: "R-HyperCVAD"
- Drug: "rituximab"
- Drug: "cyclophosphamide"
- Drug: "vincristine sulfate"
- Drug: "doxorubicin hydrochloride"
- Drug: "dexamethasone"
- Drug: "rituximab"
- Drug: "anthracycline"
- Temporal: "after"
- Reference_point: "prior rituximab and anthracycline-containing systemic treatment regimen"